Why are male calico cats rare?

The tortoishell coat colour is characteristic to female cats, and its occurrence in tom cats is very rare and associated with chromosome abnormalities.